Women between 40 to 70 years of age.

The above is a clinical trial inclusion criterion. Annotated with entity spans:
[Person: Women] [Value: between 40 to 70 years] of [Person: age].